What is caused by a gain-of-function mutation in CLCN2?

A gain-of-function mutation in the CLCN2 chloride channel gene causes primary aldosteronism.